眼球要往外上方看時，需靠外直肌和下列那一條眼肌共同作用？
A. 上直肌
B. 上斜肌
C. 下直肌
D. 下斜肌

正確答案：A. 上直肌